Clinical trial inclusion criterion:
Treated with a stable dose of one of the following for at least 3 months prior to screening: * >=1000 mg/day immediate-release metformin; or metformin >=1000 mg/day and sulfonylurea; or sulfonylurea/metformin combination therapy.

Entity relations:
- Has_temporal("stable dose", "at least 3 months prior to screening")
- AND(">=1000 mg/day", "metformin")
- AND("combination therapy", "metformin")
- AND("combination therapy", "sulfonylurea")
- AND(">=1000 mg/day", "immediate-release metformin")
- Has_qualifier(">=1000 mg/day", "stable dose")
- Has_index("at least 3 months prior to screening", "screening")
- Has_multiplier(">=1000 mg/day", "one of the following")
- OR("immediate-release metformin", ">=1000 mg/day", "combination therapy")